Clinical trial inclusion criterion:
transit nodules not surgically resectable

Entity relations:
- Has_negation("surgically resectable", "not")
- Has_qualifier("transit nodules", "surgically resectable")
- multi("surgically resectable", "surgically")